Medically and neurologically healthy on the basis of physical examination and medical history.

The above is a clinical trial inclusion criterion. Annotated with entity spans:
[Condition: Medically] and [Condition: neurologically healthy] on the basis of [Procedure: physical examination] and [Temporal: medical history].